Please list the syndromes that are part of Castleman's disease AKA TAFRO

The syndromes that are part of Castleman's disease AKA TAFRO are organomegaly, anasarca, myelofibrosis, thrombocytopenia and reticulin fibrosis. There is also renal dysfunction.